Clinical trial inclusion criteria:
Age = 18 years and NYHA (New York Heart Association) functional class II, III and IV

Annotated entities:
- Person: "Age"
- Value: "= 18 years"
- Measurement: "NYHA (New York Heart Association) functional class"
- Value: "II, III and IV"